Uncontrolled intercurrent illness including, but not limited to, uncontrolled diabetes, ongoing or active infection, symptomatic congestive heart failure (New York Heart Association Class III and IV heart failure), unstable angina pectoris, cardiac arrhythmia, or psychiatric illness/social situations/substance abuse that would limit compliance with study requirements.

The above is a clinical trial exclusion criterion. Annotated with entity spans:
[Qualifier: Uncontrolled] [Condition: intercurrent illness] including, but not limited to, [Qualifier: uncontrolled] [Condition: diabetes], [Temporal: ongoing] or [Qualifier: active] [Condition: infection], [Qualifier: symptomatic] [Condition: congestive heart failure] ([Measurement: New York Heart Association] [Value: Class III and IV] [Condition: heart failure]), [Condition: unstable angina pectoris], [Condition: cardiac arrhythmia], or [Condition: psychiatric illness]/[Condition: social situations]/[Condition: substance abuse] that would limit compliance with study requirements.